The participant has a history of clinically significant hypertension or other reactions associated with ingestion of tyramine-rich food.

The above is a clinical trial exclusion criterion. Annotated with entity spans:
The participant has a history of [Qualifier: clinically significant] [Condition: hypertension] or other [Condition: reactions associated with ingestion of tyramine-rich food].